Clinical trial inclusion criterion:
Predicted adult height (based on bone age) more than 10 cm below target height (mid parental height)

Annotated entities:
- Measurement: "Predicted adult height"
- Qualifier: "bone age"
- Value: "more than 10 cm below target height"
- Qualifier: "mid parental height"